Clinical trial exclusion criterion:
Alcohol or Drug Dependence within 12 months or Abuse within 3 months (excluding nicotine and caffeine) of baseline visit, as assessed by history and urine drug screen.

Annotated entities:
- Condition: "Drug Dependence"
- Condition: "Alcohol Dependence"
- Temporal: "within 12 months"
- Condition: "Alcohol Abuse"
- Condition: "Drug Abuse"
- Temporal: "within 3 months"
- Drug: "nicotine"
- Drug: "caffeine"
- Measurement: "urine drug screen"